Clinical trial inclusion criterion:
Children 7-17 with moderate to severe pain requiring around the clock treatment with an opioid analgesic.

Annotated entities:
- Person: "Children"
- Condition: "pain"
- Qualifier: "moderate"
- Qualifier: "severe"
- Drug: "opioid analgesic"
- Procedure: "around the clock treatment"